Clinical trial inclusion criterion:
Age 18 to 45 years Irregular menstruation (> 35 days) or secondary amenorrhea> 3 months

Entity relations:
- Subsumes("Irregular menstruation", "> 35 days")
- Has_temporal("secondary amenorrhea", "> 3 months")
- OR("Irregular menstruation", "secondary amenorrhea")